Age 10 to 65 years

The above is a clinical trial inclusion criterion. Annotated with entity spans:
[Person: Age] [Value: 10 to 65 years]